下列何者是造成1歲健康兒童罹患急性細支氣管炎（Acute bronchiolitis）的最常見病原？
A. 人類間質肺炎病毒（Human metapneumovirus）
B. 呼吸道融合病毒（Respiratory syncytial virus）
C. 副流感病毒（Parainfluenza）
D. 肺炎披衣菌（Chlamydia pneumoniae）

正確答案：B. 呼吸道融合病毒（Respiratory syncytial virus）